Clinical trial inclusion criterion:
Body Mass Index (BMI) between 18 <= BMI <= 27 kilogram per meter square (kg/m^2)

Entity relations:
- Has_value("Body Mass Index (BMI)", "between 18 <= BMI <= 27 kilogram per meter square (kg/m^2)")